Clinical trial inclusion criterion:
Kidney transplant recipients at Washington University/Barnes-Jewish Hospital

Annotated entities:
- Procedure: "Kidney transplant"
- Visit: "Washington University/Barnes-Jewish Hospital"